Clinical trial exclusion criterion:
Smokers.

Annotated entities:
- Observation: "Smokers"